Hematochrit >36%

The above is a clinical trial exclusion criterion. Annotated with entity spans:
[Measurement: Hematochrit] [Value: >36%]